下列關於手術前後腎臟功能的評估，何者最敏感而且專一性最佳？
A. 肌酸酐廓清率（creatinine clearance rate）
B. 血清尿素氮（blood urea nitrogen, BUN）
C. 血清肌酸酐（creatinine）
D. 尿液形成量（urine formation）

正確答案：A. 肌酸酐廓清率（creatinine clearance rate）